As of 2019, what type of cancer is commonly associated with ionizing radiation

Exposure to ionizing radiation increases the risk for thyroid and breast cancer and leukemia as well as others such as osteosarcoma.